胺基酸最主要是經由下列何種代謝路徑間接產生葡萄糖（glucose）?
A. pentose phosphate pathway
B. urea cycle
C. oxidative phosphorylation
D. citric acid cycle

正確答案：D. citric acid cycle